Clinical trial exclusion criterion:
Patients <65 years of age

Entity relations:
- Has_value("age", "<65 years")